routinely referred for small bowel video capsule endoscopy (CE)

The above is a clinical trial inclusion criterion. Annotated with entity spans:
[Multiplier: routinely referred] for [Procedure: small bowel video capsule endoscopy] (CE)